Prior use of any experimental agent used as a DMT for MS in the last five years

The above is a clinical trial exclusion criterion. Annotated with entity spans:
[Non-query-able: Prior use of any experimental agent used as a DMT for MS in the last five years]